6歲大男生，被發現肝功能異常，懷疑是Wilson disease， 下列何者錯誤？
A. Wilson disease是性聯隱性遺傳
B. serum copper和ceruloplasmin 在Wilson disease早期不一定會低
C. 5歲以上找不到合理解釋的肝功能異常病人，Wilson disease應被列為鑑別診斷之一
D. 應會診眼科，看cornea 是否有Kayser-Fleischer (K-F) ring

正確答案：A. Wilson disease是性聯隱性遺傳